Clinical trial inclusion criterion:
Men and women aged > 18 years

Annotated entities:
- Person: "Men"
- Person: "women"
- Person: "aged"
- Value: "> 18 years"